Male and female patients between the ages of 18-65 years, inclusive

The above is a clinical trial inclusion criterion. Annotated with entity spans:
[Person: Male] and [Person: female] patients between the [Person: ages] of [Value: 18-65 years], inclusive